Clinical trial inclusion criterion:
Established T2DM (=3months)

Annotated entities:
- Condition: "T2DM"
- Temporal: "=3months"